Subjects with known hypersensitivity to tranexamic acid

The above is a clinical trial exclusion criterion. Annotated with entity spans:
Subjects with known [Condition: hypersensitivity] to [Drug: tranexamic acid]